Clinical trial exclusion criterion:
Patients weighing more than 30 kg that would exceed maximum dexamethasone dose

Annotated entities:
- Measurement: "weighing"
- Value: "more than 30 kg"
- Non-representable: "that would exceed maximum dexamethasone dose"